Clinical trial exclusion criteria:
recent thrombotic event

Annotated entities:
- Temporal: "recent"
- Condition: "thrombotic event"